Clinical trial exclusion criterion:
Weight-loss of >5kg in the preceding 6 months

Annotated entities:
- Observation: "Weight-loss"
- Value: ">5kg"
- Temporal: "preceding 6 months"